一個足月順產的新生兒，出生的前 2 天並沒有異狀，也已經開始規律性的哺乳。但是在第 3 天時出現進食不良以及嗜睡的現象，經抽血檢查後疑似尿素循環障礙。您覺得下列那一組實驗室診斷數據，最能讓您做出上述的診斷？
A. Glucose 60 mg/dL, pH 7.45, NH3：800 μmol/L, Lactic acid 2.5 mmol/L
B. Glucose 50 mg/dL, pH 7.10, NH3：120 μmol/L, Lactic acid 4.0 mmol/L
C. Glucose 50 mg/dL, pH 7.40, NH3：50 μmol/L, Lactic acid 2.5 mmol/L
D. Glucose 10 mg/dL, pH 7.30, NH3：50 μmol/L, Lactic acid 12 mmol/L

正確答案：A. Glucose 60 mg/dL, pH 7.45, NH3：800 μmol/L, Lactic acid 2.5 mmol/L